Clinical trial inclusion criterion:
3. Male or female between the ages of 2-99.

Annotated entities:
- Parsing_Error: "3."
- Person: "female"
- Person: "Male"
- Person: "the ages"
- Value: "between 2-99"